What is "enhancer hijacking"?

Enhancer hijacking is the molecular process through which a structural variant removes or moves a TAD boundary to expose TSSs to regulatory enhancers from which they would normally be insulated.